Clinical trial inclusion criterion:
Creatinen in blood = 3mg/dl

Entity relations:
- Has_value("Creatinen", "= 3mg/dl")